就精原母細胞（spermatogonium）到精子（sperm）的過程，下列那一項之順序最佳？
A. Spermatogonium→primary spermatocyte→first meiosis→secondary spermatocyte→second meiosis→ spermatid→sperm
B. Spermatogonium→first meiosis→primary spermatocyte→second meiosis→secondary spermatocyte→ spermatid→sperm
C. Spermatogonium→primary spermatocyte→first meiosis→secondary spermatocyte→spermatid→second meiosis→sperm
D. Spermatogonium→primary spermatocyte→secondary spermatocyte→first meiosis→spermatid→second meiosis→sperm

正確答案：A. Spermatogonium→primary spermatocyte→first meiosis→secondary spermatocyte→second meiosis→ spermatid→sperm